Subject with any underlying cardiovascular condition, including unstable angina pectoris, which preclude sexual activity

The above is a clinical trial exclusion criterion. Annotated with entity spans:
Subject with any underlying [Condition: cardiovascular condition], including [Condition: unstable angina pectoris], which [Negation: preclude] [Observation: sexual activity]